malignant neoplasm of any location

The above is a clinical trial exclusion criterion. Annotated with entity spans:
[Qualifier: malignant] [Condition: neoplasm] of any location